Where is the metaxin complex localized?

The metaxin complex is localized to the outer mitochondrial membrane.